Subjects who are within their ideal body weight (BMI between >17 and =28 kg/m2)

The above is a clinical trial inclusion criterion. Annotated with entity spans:
Subjects who are within their ideal body weight ([Measurement: BMI] [Value: between >17 and =28 kg/m2])